第一型肝醣貯積病（type I glycogen storage disease）是由於 glucose-6-phosphatase 缺失導致，下列何者為其臨床生化特徵？
A. hyperglycemia
B. hypouremia
C. hypolipemia
D. ketosis

正確答案：D. ketosis